Clinical trial inclusion criterion:
NIHSS: 4-25;

Entity relations:
- Has_value("NIHSS", "4-25")